Diagnosed or past history of ASCVD (including ACS, SCAD, revascularization, ICM, ischemic stroke, TIA, PASD, etc.

The above is a clinical trial exclusion criterion. Annotated with entity spans:
Diagnosed or past history of [Condition: ASCVD] (including [Condition: ACS], [Condition: SCAD], [Procedure: revascularization], [Condition: ICM], [Condition: ischemic stroke], [Condition: TIA], [Condition: PASD], etc.